Intellectual level which allows to filling in the diaries for registering of symptoms at home;

The above is a clinical trial inclusion criterion. Annotated with entity spans:
[Undefined_semantics: Intellectual level which allows to filling in the diaries for registering of symptoms at home;]